Concomitant administration of any other experimental drug under investigation, or concomitant chemotherapy, hormonal therapy, or immunotherapy

The above is a clinical trial exclusion criterion. Annotated with entity spans:
[Temporal: Concomitant] administration of any other [Drug: experimental drug] under investigation, or [Temporal: concomitant] [Procedure: chemotherapy], [Procedure: hormonal therapy], or [Procedure: immunotherapy]